Clinical trial exclusion criteria:
A prescription of a NOAC within 90 days prior to hospitalization or outpatient clinic visit for VTE.
Patients with NOAC preference apart from preference consistent with current cluster randomized NOAC.
Other contraindications mentioned in the "Summary of Product Characteristics" for the respective NOAC.

Annotated entities:
- Drug: "NOAC"
- Temporal: "within 90 days prior to hospitalization or outpatient clinic visit for VTE"
- Condition: "VTE"
- Reference_point: "hospitalization or outpatient clinic visit for VTE"
- Procedure: "hospitalization"
- Procedure: "outpatient clinic visit"
- Visit: "outpatient clinic"
- Visit: "hospitalization"
- Drug: "NOAC"
- Observation: "NOAC preference"
- Non-representable: "apart from preference consistent with current cluster randomized NOAC."
- Condition: "contraindications"
- Qualifier: "Other"
- Qualifier: "Summary of Product Characteristics"
- Drug: "NOAC"